La amnesia anterógrada es consecuencia de daño cerebral en:
1. El hipocampo, sus aferencias o eferencias.
2. El hipotálamo, sus aferencias o eferencias.
3. El tálamo, sus aferencias o eferencias.
4. La hipófisis, sus aferencias o eferencias.
5. La corteza órbitofrontal, sus aferencias o eferencias.

Respuesta correcta: 1. El hipocampo, sus aferencias o eferencias.